Clinical trial exclusion criterion:
Other acquired or inherited causes of liver disease: alcoholic liver disease, obesity induced liver disease, drug related liver disease, auto-immune hepatitis, hemochromatosis, Wilson's disease or alpha-1 antitrypsin deficiency

Annotated entities:
- Condition: "liver disease"
- Qualifier: "inherited"
- Qualifier: "acquired"
- Condition: "alcoholic liver disease"
- Condition: "obesity induced liver disease"
- Condition: "drug related liver disease"
- Condition: "auto-immune hepatitis"
- Condition: "hemochromatosis"
- Condition: "Wilson's disease"
- Condition: "alpha-1 antitrypsin deficiency"